下列何處是突觸後多巴胺一型和二型受器（D1/D2）的主要分布地方？
A. 殼核（putamen）
B. 底丘腦核（subthalamic nucleus）
C. 蒼白球（globus pallidus）
D. 黑質（substantia nigra）

正確答案：A. 殼核（putamen）